下列何者屬於脂溶性的電子傳遞者？
A. cytochrome c
B. NADH
C. FADH2
D. coenzyme Q

正確答案：D. coenzyme Q